TLC > 120% predicted, RV > 150% predicted.

The above is a clinical trial inclusion criterion. Annotated with entity spans:
[Measurement: TLC] [Value: > 120% predicted], [Measurement: RV] [Value: > 150% predicted].